Clinical trial inclusion criterion:
18-45 yrs old

Entity relations:
- Has_value("old", "18-45 yrs")